Ibuprofen Allergy/interlerance

The above is a clinical trial exclusion criterion. Annotated with entity spans:
[Drug: Ibuprofen] [Condition: Allergy]/[Condition: interlerance]